Clinical trial inclusion criterion:
performance status ECOG = 2 (Eastern Cooperative Oncology Group)

Annotated entities:
- Measurement: "ECOG"
- Value: "= 2"
- Measurement: "performance status"
- Measurement: "Eastern Cooperative Oncology Group"